下列有關皮質醇（cortisol）之作用，何者正確？
A. 抑制骨生成（bone formation）
B. 促進發炎反應
C. 增加肌肉量（muscle mass）
D. 降低腎小球濾過率（GFR）

正確答案：A. 抑制骨生成（bone formation）